En evaluación psicológica la entrevista inicial tiene como principal objetivo:
1. Realizar el diagnostico.
2. Identificar y clarificar la demanda.
3. Concluir la anamnesis.
4. Pasarle la mayor cantidad de test pertinentes en el tiempo disponible.

Respuesta correcta: 2. Identificar y clarificar la demanda.